Which protein is the main marker of Cajal bodies?

Coilin, more than a molecular marker of the cajal (coiled) body The Cajal body has now regained the interest of biologists, due to the isolation of a protein marker, coilin.